Clinical trial inclusion criterion:
A diagnosis of VTE in outpatient clinic or as discharge diagnosis after hospitalization.

Annotated entities:
- Condition: "VTE"
- Visit: "outpatient clinic"
- Qualifier: "discharge diagnosis"
- Temporal: "after hospitalization"
- Reference_point: "hospitalization"
- Procedure: "hospitalization"